下列何者不是以大腸桿菌為衛生指標的理由？
A. 容易檢驗
B. 對氯的抵抗力強
C. 生存力較一般病原菌強
D. 一般排泄物必有

正確答案：B. 對氯的抵抗力強